病人處於 hypercatabolic state，血液及尿液裏的 urea nitrogen 濃度會上升，下述何者錯誤？
A. 代表 protein degradation 增加
B. urea nitrogen 的來源是 amino acid
C. amino acid 經 urea cycle 轉化為 urea
D. urea cycle 主要在 kidney 發生

正確答案：D. urea cycle 主要在 kidney 發生